Con respecto al Sistema Nervioso Simpático o SNS, señala la alternativa INCORRECTA:
1. Interviene en la respuesta de estrés, definida como “lucha o huida”.
2. Aumenta la presión arterial y la frecuencia cardíaca.
3. Dilata los bronquios.
4. Aumenta la actividad de las glándulas sudoríparas.
5. Estimula la motilidad gastrointestinal.

Respuesta correcta: 5. Estimula la motilidad gastrointestinal.